Routine bloods including U&E, FBC, LFTs, inflammatory markers (CRP) and albumin will be measured.

The above is a clinical trial inclusion criterion. Annotated with entity spans:
[Procedure: Routine bloods] including [Procedure: U&E], [Procedure: FBC], [Procedure: LFTs], [Procedure: inflammatory markers (CRP)] and [Procedure: albumin] will be measured.